Severe mitral regurgitation (Regurgitant volume = 60 mL/beat, Regurgitant fraction = 50%, and/or Effective regurgitant orifice area = 0.40cm2)

The above is a clinical trial exclusion criterion. Annotated with entity spans:
[Qualifier: Severe] [Condition: mitral regurgitation] ([Measurement: Regurgitant volume] [Value: = 60 mL/beat], [Measurement: Regurgitant fraction] [Value: = 50%], and/or [Measurement: Effective regurgitant orifice area] [Value: = 0.40cm2])